Pregnancy and Lactation

The above is a clinical trial exclusion criterion. Annotated with entity spans:
[Condition: Pregnancy] and [Condition: Lactation]